Previous receipt of meningococcal B vaccine (Bexsero)

The above is a clinical trial exclusion criterion. Annotated with entity spans:
[Temporal: Previous] receipt of [Drug: meningococcal B vaccine] ([Drug: Bexsero])